Clinical trial inclusion criterion:
satisfying DSM-V criteria for ED and for half of the patients in addition

Entity relations:
- Has_value("DSM-V criteria", "satisfying")
- AND("ED", "DSM-V criteria")